Clinical trial exclusion criterion:
Active autoimmune disease that has required systemic treatment in past 2 years

Annotated entities:
- Condition: "autoimmune disease"
- Temporal: "Active"
- Procedure: "systemic treatment"
- Temporal: "in past 2 years"